Clinical trial inclusion criterion:
Patients may have received prior definitive radiation therapy or surgery. At least 60 days must have elapsed since completion of definitive radiation therapy or surgery and patient must have only grade 2 or less adverse effects at the time of registration. Enrollment during palliative radiation of = 10 days, or radiation of = 10 days during the duration of the study is allowed.

Annotated entities:
- Temporal: "prior"
- Qualifier: "definitive"
- Procedure: "radiation therapy"
- Procedure: "surgery"
- Temporal: "At least 60 days must have elapsed since completion of definitive radiation therapy or surgery"
- Procedure: "radiation therapy"
- Procedure: "surgery"
- Qualifier: "definitive"
- Reference_point: "completion of definitive radiation therapy or surgery"
- Qualifier: "grade 2 or less"
- Condition: "adverse effects"
- Temporal: "at the time of registration"
- Non-representable: "Enrollment during palliative radiation of = 10 days, or radiation of = 10 days during the duration of the study is allowed."